La microfiltración y filtración estéril en el tratamiento de agua para uso farmacéutico:
1. Separa pequeñas partículas en el intervalo comprendiendo entre 0,1 – 10 μm.
2. Se usan para clarificar soluciones.
3. Elimina toda la contaminación viral de una preparación tópica.
4. Sólo se utiliza para retirar de un líquido las partículas con un diámetro superior a 0,001 µm.

Respuesta correcta: 1. Separa pequeñas partículas en el intervalo comprendiendo entre 0,1 – 10 μm.